Clinical trial exclusion criterion:
2. First-degree family history of any neurological disorder with a potentially hereditary basis, including migraines, epilepsy, or multiple sclerosis.

Entity relations:
- Has_qualifier("neurological disorder", "potentially hereditary basis")
- Subsumes("neurological disorder", "migraines")
- Has_context("neurological disorder", "family history of")
- Has_qualifier("family history of", "First-degree")
- OR("migraines", "multiple sclerosis", "epilepsy")